Clinical trial inclusion criterion:
weigh more than 200 lbs

Annotated entities:
- Measurement: "weigh"
- Value: "more than 200 lbs"